Clinical trial exclusion criterion:
Abnormal renal or liver function

Entity relations:
- OR("Abnormal liver function", "Abnormal renal function")